For how long do Drosophila embryos use maternal genome mRNA?

before interphase 14